Subjects currently consuming =5 units of alcohol per day

The above is a clinical trial exclusion criterion. Annotated with entity spans:
Subjects [Temporal: currently] [Observation: consuming] [Value: =5 units] of alcohol per day